Clinical trial exclusion criterion:
Known allergy or hypersensitive reaction to dexmedetomidine

Annotated entities:
- Condition: "allergy"
- Condition: "hypersensitive"
- Drug: "dexmedetomidine"